Clinical trial exclusion criterion:
Human immunodeficiency virus (HIV)-infected

Annotated entities:
- Condition: "Human immunodeficiency virus (HIV)-infected"